下列關於味覺核（gustatory nucleus）的敘述，何者錯誤？
A. 位於孤立核（solitory nucleus）之吻端
B. 所發出之神經纖維投射至對側丘腦
C. 接受第七、九、十對顱神經的味覺神經投射
D. 位於迷走神經背核（dorsal nucleus of vagus nerve）之外側

正確答案：B. 所發出之神經纖維投射至對側丘腦